Clinical trial exclusion criterion:
Subject with primary hypoactive sexual desire.

Annotated entities:
- Observation: "primary hypoactive sexual desire"